Clinical trial inclusion criteria:
Healthy men and women, age 40-75 yrs, without any disease and need of medication.
Born, raised and currently living at low altitude (<800m).
Written informed consent.
Kyrgyz ethnicity

Annotated entities:
- Person: "men"
- Person: "women"
- Person: "age"
- Value: "40-75 yr"
- Qualifier: "Healthy"
- Negation: "without"
- Condition: "disease"
- Qualifier: "any"
- Procedure: "medication"
- Non-query-able: "Born, raised and currently living at low altitude (<800m)"
- Post-eligibility: "Written informed consent"
- Non-query-able: "Kyrgyz ethnicity"